鑑別復發性星狀細胞瘤（recurrent astrocytoma）與放射治療後的腦部壞死（radiation necrosis of brain），最好的檢查是：
A. 電腦斷層（computed tomography, CT）
B. 磁振造影（magnetic resonance imaging, MRI）
C. 正子電腦斷層（positron emission tomography, PET）
D. 單光子電腦斷層（single-photon emission computed tomography, SPECT）

正確答案：C. 正子電腦斷層（positron emission tomography, PET）